Clinical trial exclusion criterion:
Hypersensitivity, including allergy, to any component of vaccines, medicinal products or medical equipment whose use is foreseen in this study.

Entity relations:
- Has_qualifier("component of vaccines", "whose use is foreseen in this study")
- AND("Hypersensitivity", "component of vaccines")
- OR("Hypersensitivity", "allergy")
- OR("component of vaccines", "medical equipment", "medicinal products")